Treated currently with golimumab or certolizumab

The above is a clinical trial exclusion criterion. Annotated with entity spans:
Treated currently with [Drug: golimumab] or [Drug: certolizumab]